Clinical trial exclusion criterion:
Chronic liver disease or cirrhosis

Entity relations:
- OR("Chronic liver disease", "cirrhosis")